Clinical trial inclusion criterion:
Patients must have undergone segmental mastectomy (i.e., lumpectomy).

Annotated entities:
- Procedure: "segmental mastectomy"
- Procedure: "lumpectomy"